Liver disease

The above is a clinical trial inclusion criterion. Annotated with entity spans:
[Condition: Liver disease]